written informed consent obtained

The above is a clinical trial inclusion criterion. Annotated with entity spans:
[Post-eligibility: written informed consent obtained]